Clinical trial inclusion criterion:
ability to read and understand English

Annotated entities:
- Observation: "ability to read English"
- Observation: "ability to understand English"